Clinical trial exclusion criterion:
Current severe heart failure (New York Heart Association class IV). Subjects will also be excluded if they have a known ejection fraction of <30% or if they have an implantable cardioverter defibrillator (ICD).

Entity relations:
- Has_qualifier("heart failure", "severe")
- Has_value("New York Heart Association", "class IV")
- Subsumes("severe", "New York Heart Association")
- Has_value("ejection fraction", "<30%")
- OR("ejection fraction", "implantable cardioverter defibrillator (ICD)")